Subjects with PID, eg, with a diagnosis of common variable immunodeficiency or X-linked agammaglobulinemia, as defined by the Pan American Group for Immune Deficiency and the European Society of Immune Deficiencies.

The above is a clinical trial inclusion criterion. Annotated with entity spans:
Subjects with [Condition: PID], eg, with a diagnosis of [Condition: common variable immunodeficiency] or [Condition: X-linked agammaglobulinemia], as defined by the [Measurement: Pan American Group for Immune Deficiency] [Non-query-able: and] the [Measurement: European Society of Immune Deficiencies].